What is septicemia?

Septicemia occurs when a bacterial infection elsewhere in the body, such as the lungs or skin, enters the bloodstream.